Previous diagnoses of COPD and HF under optimized clinical treatment as judged by the accompanying physician

The above is a clinical trial inclusion criterion. Annotated with entity spans:
Previous diagnoses of [Condition: COPD] and [Condition: HF] under [Qualifier: optimized] [Procedure: clinical treatment] as judged by the accompanying physician